因為父親罹患開放性肺結核而接受接觸者檢查的23歲男性，他的胸部X光檢查正常，但丙型干擾素血液測 （interferon-γ release assay）為陽性。下列何種建議最不適當？
A. 接受9個月的每日一次isoniazid治療
B. 接受12個劑量的每星期一次isoniazid及rifapentine治療
C. 接受2個月的每日一次rifampin及pyrazinamide治療
D. 若其父親罹患的菌株為isoniazid抗藥性，可建議服用4個月的rifampin治療

正確答案：C. 接受2個月的每日一次rifampin及pyrazinamide治療